Clinical trial inclusion criterion:
Existence of a contraceptive method for women of child-bearing age

Annotated entities:
- Device: "contraceptive method"
- Person: "women"
- Value: "child-bearing"
- Person: "age"